Clinical trial exclusion criterion:
Current DVT

Annotated entities:
- Procedure: "DVT"
- Temporal: "Current"